Clinical trial inclusion criterion:
Admitted to any ICU and receiving invasive mechanical ventilation

Annotated entities:
- Visit: "ICU"
- Procedure: "mechanical ventilation"
- Qualifier: "invasive"